Clinical trial inclusion criterion:
Subject must be at least 30 years of age.

Entity relations:
- Has_value("age", "at least 30 years")